Clinical trial exclusion criterion:
Uremia patients under hemodialysis or continuous ambulatory peritoneal dialysis or patients with Ccr < 50 mL/min

Entity relations:
- Has_value("Ccr", "< 50 mL/min")
- AND("Uremia", "hemodialysis")
- OR("hemodialysis", "continuous ambulatory peritoneal dialysis")
- OR("hemodialysis", "Ccr")